Clinical trial exclusion criterion:
known allergy to any of drugs used

Entity relations:
- AND("allergy", "drugs used")